En las clasificaciones diagnósticas DSM (IVTR y 5) ¿En qué tipo de trastornos se incluye el Trastorno de Deseo Sexual Hipoactivo?:
1. Trastorno de la identidad sexual.
2. Parafilias.
3. Disfunciones sexuales.
4. Trastornos sexuales no especificados.

Respuesta correcta: 3. Disfunciones sexuales.